Clinical trial inclusion criterion:
Free from chronic disease e.g. malignancy requiring frequent medical attention (as from the Ante-natal card)

Annotated entities:
- Condition: "chronic disease"
- Condition: "malignancy"